severe underlying illness, such as end stage renal disease, decompensated liver cirrhosis, or non-curative malignancy

The above is a clinical trial exclusion criterion. Annotated with entity spans:
[Condition: severe underlying illness], such as [Condition: end stage renal disease], [Qualifier: decompensated] [Condition: liver cirrhosis], or [Qualifier: non-curative] [Condition: malignancy]